preexisting pectoral, axillar, thoracic homolateral pain

The above is a clinical trial exclusion criterion. Annotated with entity spans:
preexisting [Condition: pectoral], [Condition: axillar], [Condition: thoracic] [Qualifier: homolateral] pain